bleeding dyscrasia

The above is a clinical trial exclusion criterion. Annotated with entity spans:
[Condition: bleeding dyscrasia]